History of hypersensitivity to proteins (e.g., allergy shots).

The above is a clinical trial exclusion criterion. Annotated with entity spans:
[Temporal: History] of [Condition: hypersensitivity to proteins] (e.g., allergy shots).